Clinical trial inclusion criterion:
Adults (18 and older) with physiologically confirmed SA or mild-moderate asthma and followed by an asthma specialist for at least 6 months.

Annotated entities:
- Value: "18 and older"
- Person: "Adults"
- Person: "18 and older"
- Condition: "SA"
- Condition: "asthma"
- Qualifier: "mild"
- Qualifier: "moderate"
- Observation: "followed by an asthma specialist"
- Temporal: "for at least 6 months"